由於病人也訴說背痛，照了一張腰椎的 X 光片，發現有退化性骨關節炎，可能有脊椎狹窄（Spinal stenosis）的現象，由於脊椎狹窄也會造成下肢疼痛的症狀，此二者如何分別？
A. 動脈阻塞造成疼痛強度大於脊椎狹窄之疼痛
B. 脊椎狹窄造成之疼痛強度大於動脈阻塞造成之疼痛
C. 脊椎狹窄造成之疼痛往往在長時間走動後發生，而動脈阻塞造成的則否
D. 脊椎狹窄所造成的疼痛和腰部姿勢改變有關，而動脈阻塞造成之疼痛則否

正確答案：D. 脊椎狹窄所造成的疼痛和腰部姿勢改變有關，而動脈阻塞造成之疼痛則否